A pH neutro, una mezcla de aminoácidos en disolución serían predominantemente:
1. Iones dipolares.
2. Moléculas no polares.
3. Positivos y monovalentes.
4. Hidrófobos.
5. Negativos y monovalentes.

Respuesta correcta: 1. Iones dipolares.